Clinical trial exclusion criterion:
Strict contraindication or inability to receive enteral medications;

Entity relations:
- AND("contraindication", "enteral medications")